Clinical trial inclusion criterion:
Patient with "de novo" heart Failure and LVEF <= 40% admitted in hospital, without contraindications for BB prescription with cardiologist up-titration prescription and without having achieved BB target dose previous discharge and signing informed consent.

Entity relations:
- Has_value("LVEF", "<= 40%")
- AND("admitted", "hospital")
- Has_qualifier("heart Failure", "de novo")
- Has_negation("contraindications", "without")
- AND("contraindications", "BB")